Clinical trial exclusion criterion:
history of substance abuse or current excessive use of alcohol

Annotated entities:
- Temporal: "history"
- Condition: "substance abuse"
- Temporal: "current"
- Condition: "excessive use of alcohol"